Clinical trial inclusion criterion:
Aged at least 18 years

Annotated entities:
- Value: "at least 18 years"
- Person: "Aged"